一位 34 歲系統性紅斑性狼瘡的患者，有一天突然行為異常，胡言亂語，後續追蹤的腦部電腦斷層檢查並未發現有出血或腦血管阻塞的情況。則這種異常表現的發生可能與下列血清中的何種抗體有關？
A. Anti-phospholipid antibody
B. Anti-ribonucleoprotein antibody
C. Anti-Ro（SS-A）& anti-La（SS-B）antibody
D. Anti-ribosomal P antibody

正確答案：D. Anti-ribosomal P antibody